Clinical trial inclusion criterion:
3. Residence in AFRH-Washington D.C. or the Veterans Home of California-Yountville

Entity relations:
- Has_context("AFRH-Washington D.C.", "Residence")
- OR("AFRH-Washington D.C.", "Veterans Home of California-Yountville")